Clinical trial inclusion criterion:
Male or female between, and including, 6-12 weeks (42 to 90 days) of age at the time of the first vaccination.

Annotated entities:
- Value: "between 6-12 weeks"
- Value: "between 42 to 90 days"
- Person: "of age"
- Temporal: "at the time of the first vaccination"